elevated risk for volume depletion, e.g. history of severe volume depletion that required medical therapy

The above is a clinical trial exclusion criterion. Annotated with entity spans:
[Qualifier: elevated] [Observation: risk for volume depletion,] e.g. history of severe volume depletion that required medical therapy